Clinical trial exclusion criterion:
Subjects who had a hypersensitivity to antibiotics or antimycotics

Annotated entities:
- Condition: "hypersensitivity"
- Drug: "antibiotics"
- Drug: "antimycotics"